For how long do Drosophila embryos use maternal genome mRNA?

Mitoses before interphase 14 run on maternal products, and occur in metasynchronous waves. In many animals, the first few hours of life proceed with little or no transcription, and developmental regulation at these early stages is dependent on maternal cytoplasm rather than the zygotic nucleus.